Guillain- Barré syndrome within eight weeks of a previous influenza vaccine

The above is a clinical trial exclusion criterion. Annotated with entity spans:
[Condition: Guillain- Barré syndrome] [Temporal: within eight weeks of a previous influenza vaccine]